Clinical trial inclusion criterion:
Post-procedural residual diameter stenosis of the treated lesions < 20% in patients with stent implantation or < 50% in those with balloon angioplasty

Entity relations:
- Has_qualifier("lesions", "treated")
- Has_context("lesions", "Post-procedural residual diameter stenosis")
- Has_value("Post-procedural residual diameter stenosis", "< 20%")
- AND("lesions", "stent implantation")
- Has_qualifier("lesions", "treated")
- Has_context("lesions", "Post-procedural residual diameter stenosis")
- Has_value("Post-procedural residual diameter stenosis", "< 50%")
- AND("lesions", "balloon angioplasty")
- OR("lesions", "lesions")